¿Cuál será la carga del aminoácido glutámico a pH 7?
1. No tendrá carga neta.
2. Tendrá carga neta negativa.
3. Tendrá carga neta positiva.
4. Su cadena lateral estará protonada.
5. Su grupo α-amino estará desprotonado.

Respuesta correcta: 2. Tendrá carga neta negativa.